Unstable angina

The above is a clinical trial exclusion criterion. Annotated with entity spans:
[Condition: Unstable angina]